有關綠膿桿菌角膜炎（pseudomonal keratitis）的敘述，何者正確？
A. 病程相當良性
B. 大多與配戴隱形眼鏡造成角膜之感染有關
C. 裂隙燈檢查常見衛星狀的病灶（satellite lesions）
D. 綠膿桿菌本身可以分泌蛋白酵素（protease），可防止角膜溶解、破裂

正確答案：B. 大多與配戴隱形眼鏡造成角膜之感染有關